Type 1 diabetes, as defined by ADA criteria

The above is a clinical trial exclusion criterion. Annotated with entity spans:
[Condition: Type 1 diabetes], as defined by [Qualifier: ADA criteria]